Clinical trial exclusion criteria:
Patients receiving prednisone = 1mg/kg/d for the treatment of acute GVHD or mild, severe chronic GVHD.
Recipient < 14years of age
Donor is sero-positive in HBV/HCV/HIV or RPR.

Annotated entities:
- Drug: "prednisone"
- Value: "= 1mg/kg/d"
- Condition: "acute GVHD"
- Qualifier: "mild"
- Qualifier: "severe"
- Qualifier: "chronic"
- Condition: "GVHD"
- Value: "< 14years"
- Person: "age"
- Condition: "sero-positive in HBV"
- Condition: "sero-positive in HCV"
- Condition: "sero-positive in HIV"
- Condition: "sero-positive in RPR"